The patient must be insured or beneficiary of a health insurance plan

The above is a clinical trial inclusion criterion. Annotated with entity spans:
[Non-query-able: The patient must be insured or beneficiary of a health insurance plan]